Patient able to give verbal and written consent for both cesarean birth and study

The above is a clinical trial inclusion criterion. Annotated with entity spans:
[Informed_consent: Patient able to give verbal and written consent for both cesarean birth and study]